Clinical trial exclusion criterion:
refractory bradycardia < 60 bpm despite treatment

Annotated entities:
- Qualifier: "refractory"
- Condition: "bradycardia"
- Value: "< 60 bpm"
- Qualifier: "despite treatment"
- Procedure: "treatment"